下列何種遺傳性血液疾病最常造成胎兒水腫（hydrops fetalis）？
A. 甲型海洋性貧血（α-thalassemia）
B. 乙型海洋性貧血（β-thalassemia）
C. 葡萄糖六磷酸脫氫之酵素缺乏（G6PD deficiency）
D. 遺傳性球形紅血球症（hereditary spherocytosis）

正確答案：A. 甲型海洋性貧血（α-thalassemia）